Clinical trial exclusion criterion:
Current substance use disorder according to the Diagnostic and Statistical Manual of Mental Disorders Fifth Edition (DSM 5)

Annotated entities:
- Condition: "substance use disorder"
- Qualifier: "Diagnostic and Statistical Manual of Mental Disorders Fifth Edition (DSM 5)"